Clinical trial inclusion criterion:
Intact fetal membranes

Annotated entities:
- Condition: "fetal membranes"
- Qualifier: "Intact"